抗高血壓藥物的使用方式何者最正確？
A. 長期持續性服藥
B. 等血壓控制後即可停藥
C. 間斷性服用以減少副作用
D. 只要改善生活飲食習慣即可免服抗高血壓藥物

正確答案：A. 長期持續性服藥